What is the incidence of sudden cardiac death among young athletes?

the incidence of sudden cardiac death among young athletes ranges from 0.5  to 3  per 100,000 athletes per year  .